Clinical trial inclusion criterion:
Pain duration <2 weeks (336 hours). Patients with more than two weeks of pain are at increased risk of poor pain and functional outcomes.(9)

Entity relations:
- Has_temporal("Pain", "duration <2 weeks")
- OR("duration <2 weeks", "duration 336 hours")